Clinical trial inclusion criterion:
patients = 70 years of age, undergoing a noncardiac surgical procedure under general anesthesia, with an anticipated duration of postoperative admission of at least 2 days.

Entity relations:
- Has_value("age", "= 70 years")
- AND("noncardiac surgical procedure", "general anesthesia")
- Has_value("duration of postoperative admission", "at least 2 days")
- multi("duration of postoperative admission", "admission")
- Has_temporal("admission", "postoperative")
- Has_mood("duration of postoperative admission", "anticipated")